一位62歲病人，過去有心臟病史，正在接受治療，最近因出血傾向接受檢查，周邊血中血紅素、白血球及血小板數正常，prothrombin time（PT）INR 3.5，activated partial thromboplastin time 26"（正常對照27"）。下列何者是引起這位病人容易出血的最可能原因？
A. coumadin treatment
B. heparin treatment
C. liver disease
D. von Willebrand disease

正確答案：A. coumadin treatment